Durante la inspiración la presión pleural:
1. Igual a la atmosférica.
2. Igual a la transpulmonar.
3. Positiva.
4. Negativa.

Respuesta correcta: 4. Negativa.